En la revisión anual, una persona de 70 años se siente preocupada porque ha notado la presencia en sus ojos de un anillo amarillo grisáceo alrededor del iris. ¿Cuál de las siguientes respuestas de la enfermera indica conocimiento de la condición que le preocupa al paciente?:
1. Comentarle al paciente que esta condición podría causar complicaciones y que se debe hacer ver por el especialista.
2. Informar al médico para asegurarse de que no se trata de algo serio.
3. Explicarle al paciente que se trata de un cambio normal que ocurre en el ojo por el paso del tiempo.
4. Comentarle que podría tratarse de un problema médico serio y derivarle al oftalmólogo.

Respuesta correcta: 3. Explicarle al paciente que se trata de un cambio normal que ocurre en el ojo por el paso del tiempo.